Clinical trial inclusion criterion:
undergoing unilateral mastectomy with or without axillary node dissection

Annotated entities:
- Measurement: "unilateral mastectomy"
- Temporal: "undergoing"
- Procedure: "axillary node dissection"